Clinical trial inclusion criterion:
M2 or M3 marrow on day 33

Annotated entities:
- Line: "M2 or M3 marrow on day 33"
- Condition: "M3 marrow"
- Condition: "M2 marrow"
- Temporal: "on day 33"